History of nephrolithiasis

The above is a clinical trial exclusion criterion. Annotated with entity spans:
[Temporal: History] of [Condition: nephrolithiasis]